Clinical trial inclusion criterion:
diagnosed with PD by a neurologist (Fahn and Elton, 1987);

Entity relations:
- Has_qualifier("PD", "by a neurologist")